Clinical trial exclusion criterion:
Known human immunodeficiency virus (HIV) positive

Entity relations:
- Subsumes("human immunodeficiency virus", "HIV")
- Has_value("human immunodeficiency virus", "positive")